Clinical trial exclusion criterion:
Is a user of recreational or illicit drugs or has or had a substance abuse (drug or alcohol) problem within the previous 2 years

Annotated entities:
- Intoxication_considerations: "Is a user of recreational or illicit drugs or has or had a substance abuse (drug or alcohol) problem within the previous 2 years"